What is the indication for Mirabegron?

Mirabegron, the first �3-adrenoceptor agonist in clinical practice, is approved for treatment of overactive bladder (OAB) syndrome symptoms.